Uncontrolled HCC, malignancy or decompensated liver cirrhosis (CTP score = 7).

The above is a clinical trial exclusion criterion. Annotated with entity spans:
[Qualifier: Uncontrolled] [Condition: HCC], [Condition: malignancy] or [Qualifier: decompensated] [Condition: liver cirrhosis] ([Measurement: CTP score] [Value: = 7]).